一位 66 歲男性因喪失意識入急診，剛來時血壓為 70/35 mmHg，心跳為 130/min。經過給予氧氣與生理食鹽水（normal saline）輸液 1000 mL 後，意識回復正常，血壓為 100/60 mmHg，心跳為 100/min，呼吸速率為 20/min，體溫為 36.4℃。再詳細問病人病史時發現他在喪失意識前感到突發性的腹部與下背痛，除此以外無其他症狀。有高血壓病史，但無規則服藥控制。理學檢查發現下腹有壓痛（tenderness），伴隨有輕微反彈痛（rebound tenderness），腸音稍慢，糞便檢查無潛血反應。血液檢查白血球為 7400/mm3，血色素為 11.0 g/dL，lipase 為 68 U/L，C-reactive protein（CRP）為 0.05 mg/dL， BUN/Creatinine 為 30/1.0 mg/dL，沒有尿液所以無法做尿液檢查。依以上的臨床表現，下列何種疾病最有可能，且需要馬上做鑑別診斷？
A. 腹部主動脈瘤破裂（abdominal aortic aneurysm rupture）
B. 急性膀胱炎（acute cystitis）
C. 腸缺血（mesenteric ischemia）
D. 尿路結石（urolithiasis）

正確答案：A. 腹部主動脈瘤破裂（abdominal aortic aneurysm rupture）